Which micro-RNAs (miR) are associated with the human cycloxygenase-2 (COX-2) gene promoter?

miR-146a, miR-203, miRNA-124a, microRNA-155, miRS-146b, miS-146c, miG-145, miRP-148a, let-7b, siRNA-181, miRNAs-152, miN-182, mir-223, myosin heavy chain, are associated with the human cycloxygenase-2 (COX-2) gene promoter We also report the following miRNA associations with the COX- 2 gene promoters: miCENP-1,